Clinical trial exclusion criterion:
the history or family history of anaphylaxis, convulsion, epilepsy, encephalopathy and psychosis

Entity relations:
- Has_temporal("anaphylaxis", "history")
- OR("anaphylaxis", "psychosis", "epilepsy", "convulsion", "encephalopathy")
- OR("history", "family history")